Clinical trial inclusion criterion:
Male or Female.

Entity relations:
- OR("Male", "Female")